Patients with diabetes mellitus (either primary or secondary to thalassemia).

The above is a clinical trial exclusion criterion. Annotated with entity spans:
Patients with [Condition: diabetes mellitus] (either [Qualifier: primary] or [Qualifier: secondary to thalassemia]).